¿Cuál de las siguientes isomerías NO es constitucional?:
1. De ionización.
2. De coordinación.
3. De enlace.
4. Diaestereoisomería.

Respuesta correcta: 4. Diaestereoisomería.